一位35歲女性主訴畏寒、水腫、無月經且時有乳汁分泌。血液分析發現甲狀腺激素數值過低，則此病患之無月經及泌乳現象最可能由於下列何種激素之影響？
A. 下視丘所分泌之多巴胺（dopamine）刺激腦下垂體分泌泌乳素（prolactin）
B. 下視丘所分泌之性釋素（GnRH）刺激腦下垂體分泌促黃體素（LH）
C. 下視丘所分泌之甲釋素（TRH）刺激腦下垂體分泌泌乳素（prolactin）
D. 下視丘所分泌之多巴胺（dopamine）刺激腦下垂體分泌促黃體素（LH）

正確答案：C. 下視丘所分泌之甲釋素（TRH）刺激腦下垂體分泌泌乳素（prolactin）